Clinical trial exclusion criterion:
Known hepatic or renal impairment.

Annotated entities:
- Condition: "renal impairment"
- Condition: "hepatic impairment"